下列何種藥物，最適合用於治療與 Sjögren's syndrome 有關之口乾症？
A. bethanechol
B. cevimeline
C. donepezil
D. neostigmine

正確答案：B. cevimeline